Clinical trial exclusion criterion:
Patient diagnosed with dementia.

Annotated entities:
- Condition: "dementia"